Describe SBGNview

Pathway analysis is widely used in genomics and omics research, but the data visualization has been highly limited in function, pathway coverage and data format. SBGNview is a comprehensive R package to address these needs.